Clinical trial exclusion criterion:
Use of medication such as oral glucocorticoids, anti-estrogens or other medications that are known to markedly influence insulin sensitivity.

Annotated entities:
- Drug: "oral glucocorticoids"
- Drug: "anti-estrogens"
- Drug: "medications"
- Qualifier: "other"
- Qualifier: "markedly influence insulin sensitivity"